4. The subject's upper arm circumference not adequate for proper fit of the EMG monitor (less than 14cm).

The above is a clinical trial exclusion criterion. Annotated with entity spans:
[Parsing_Error: 4.] The subject's [Measurement: upper arm circumference] [Negation: not] [Qualifier: adequate for proper fit of the EMG monitor] ([Value: less than 14cm]).